Clinical trial inclusion criterion:
Patients must have adequate organ function as defined by the following laboratory criteria:

Annotated entities:
- Value: "adequate"
- Measurement: "organ function"
- Observation: "adequate organ function"